在紅血球中，下列那一種物質可直接調控血紅素（hemoglobin）中氧分子的釋放？
A. Dihydroorotate
B. 2,3-bisphosphoglycerate
C. Fructose-1,6-bisphosphate
D. Cytochrome oxidase

正確答案：B. 2,3-bisphosphoglycerate